Clinical trial inclusion criterion:
Subjects with a measured post-albuterol/salbutamol forced expiratory volume in 1 second (FEV1)/(forced vital capacity)FVC ratio of <=0.70 at Screening (Visit 1).

Entity relations:
- Has_value("forced expiratory volume in 1 second (FEV1)/(forced vital capacity)FVC ratio", "<=0.70")
- Has_temporal("forced expiratory volume in 1 second (FEV1)/(forced vital capacity)FVC ratio", "at Screening")
- Has_temporal("post-albuterol/salbutamol", "post-albuterol/salbutamol")
- Has_index("post-albuterol/salbutamol", "albuterol/salbutamol")
- Has_qualifier("forced expiratory volume in 1 second (FEV1)/(forced vital capacity)FVC ratio", "post-albuterol/salbutamol")